下列那些先天性代謝疾病，病人身體及尿液容易有特殊的味道產生？①isovaleric acidemia  ②galactosemia ③maple syrup urine disease ④methylmalonic acidemia
A. ①②
B. ①③
C. ①④
D. ③④

正確答案：B. ①③